history or evidence of administration of immunoglobulins and/or any blood products during the study period or within the three months preceding the study vaccine

The above is a clinical trial exclusion criterion. Annotated with entity spans:
history or evidence of administration of [Procedure: immunoglobulins] [Grammar_Error: and/or] any [Procedure: blood products] [Temporal: during the study period] or [Temporal: within the three months preceding the study vaccine]